Illiteracy

The above is a clinical trial inclusion criterion. Annotated with entity spans:
[Observation: Illiteracy]